Anteriorly located tumor

The above is a clinical trial exclusion criterion. Annotated with entity spans:
[Qualifier: Anteriorly located] [Condition: tumor]